導致手術部位感染（surgical site infections）的危險因子，下列何者錯誤？
A. 手術部位有血腫
B. 低氧血症
C. 不抽菸的年輕病人
D. 營養不良

正確答案：C. 不抽菸的年輕病人